Clinical trial exclusion criterion:
Known sensitivity to any of the products administered during the study

Annotated entities:
- Condition: "sensitivity"
- Drug: "any of the products administered during the study"